血管滋養管（Vasa vasorum）位於：
A. 內膜（Tunica intima）
B. 中膜（Tunica media）
C. 外膜（Tunica adventitia）
D. 內彈性板（Internal elastic lamina）

正確答案：C. 外膜（Tunica adventitia）